Clinical trial inclusion criterion:
no contra-indication for medical induction of labor

Entity relations:
- Has_negation("contra-indication", "no")
- AND("contra-indication", "medical induction of labor")